Clinical trial exclusion criterion:
19. Any lesion that is located in a saphenous vein graft, however, lesions located within the native vessel but accessed through the graft are eligible.

Entity relations:
- multi("located in a saphenous vein graft", "saphenous vein graft")
- Has_qualifier("lesion", "located in a saphenous vein graft")
- OR("within the native vessel", "accessed through the graft")
- OR("located in a saphenous vein graft", "within the native vessel")